Señale la respuesta correcta. Según Salleras, la complejidad del mensaje de los carteles en interiores de centros sanitario debe ser:
1. Baja.
2. Media.
3. Media-Alta.
4. Alta.

Respuesta correcta: 1. Baja.